Clinical trial exclusion criterion:
8. Clinically relevant cardiac or pulmonary insufficiency.

Entity relations:
- Has_qualifier("cardiac insufficiency", "Clinically relevant")
- OR("cardiac insufficiency", "pulmonary insufficiency")